Clinical trial exclusion criterion:
Patients with known allergies to materials of bovine origin.

Entity relations:
- AND("allergies", "materials of bovine origin")